Sjogren's syndrome常見的皮膚病變，下列何者錯誤？
A. cutaneous vasculitis
B. acquired ichthyosis
C. Raynaud phenomenon
D. erythema multiforme

正確答案：B. acquired ichthyosis